Women aged above 16 years

The above is a clinical trial inclusion criterion. Annotated with entity spans:
[Person: Women] [Person: aged] [Value: above 16 years]